Respiratory failure:

The above is a clinical trial exclusion criterion. Annotated with entity spans:
[Condition: Respiratory failure]: